El isopreno es:
1. 2-metil-1,3-butadieno.
2. 2-metil-2-buteno.
3. 2-metil-1-buteno.
4. 2-etil-1,3-butadieno.
5. 2-etil-2-buteno.

Respuesta correcta: 1. 2-metil-1,3-butadieno.